Clinical trial exclusion criterion:
No hyperfluorescence on ICGA;

Entity relations:
- Has_negation("hyperfluorescence", "No")
- Has_value("ICGA", "hyperfluorescence")